Inability to refrain from NSAID use for 5 days prior to and 6 weeks after injection

The above is a clinical trial exclusion criterion. Annotated with entity spans:
[Mood: Inability to refrain from] [Drug: NSAID] use for [Temporal: 5 days prior to and 6 weeks after injection]